Clinical trial exclusion criterion:
Untreated coeliac disease or other concomitant condition likely to affect BG control

Entity relations:
- Has_qualifier("coeliac disease", "Untreated")